Clinical trial inclusion criterion:
Diagnosed with GAD according to DSM-IV

Annotated entities:
- Condition: "GAD"
- Measurement: "DSM-IV"